Clinical trial exclusion criterion:
1. Diagnosis: Diagnosis of CP secondary to neuronal migration.

Annotated entities:
- Parsing_Error: "1."
- Condition: "CP secondary to neuronal migration"